Elevated eye pressure

The above is a clinical trial inclusion criterion. Annotated with entity spans:
[Condition: Elevated eye pressure]